chronic liver disease (including known active hepatitis) and/or screening alanine transaminase (ALT) or aspartate transaminase (AST) > 3 x upper limit of normal (ULN) (confirmed on a second day)

The above is a clinical trial exclusion criterion. Annotated with entity spans:
[Condition: chronic liver disease] (including known [Condition: active hepatitis]) and/or screening [Measurement: alanine transaminase] ([Measurement: ALT]) or [Measurement: aspartate transaminase] ([Measurement: AST]) [Value: > 3 x upper limit of normal] (ULN) (confirmed on a second day)